Los modelos estructurales de la inteligencia y su medida a través de acercamiento psicométricos:
1. Nos proporcionan un conocimiento basado en los procesos cognitivos utilizados por la persona evaluada.
2. Nos revelan el funcionamiento de la inteligencia.
3. Permiten elaborar estrategias de intervención efectivas
4. Tienen como objetivo situar al sujeto en una posición dada, dentro de un grupo normativo.

Respuesta correcta: 4. Tienen como objetivo situar al sujeto en una posición dada, dentro de un grupo normativo.